Intelligence quotient (IQ) < 70

The above is a clinical trial exclusion criterion. Annotated with entity spans:
[Measurement: Intelligence quotient] ([Measurement: IQ]) [Value: < 70]